13. Prior treatment in any other interventional clinical trial within 4 weeks prior to Day 1 of the study.

The above is a clinical trial exclusion criterion. Annotated with entity spans:
[Parsing_Error: 13.] [Context_Error: Prior treatment in any other interventional clinical trial within 4 weeks prior to Day 1 of the study.]